Clinical trial exclusion criterion:
Current inpatient hospitalization or active suicidal ideation requiring referral for inpatient hospitalization for safety.

Annotated entities:
- Temporal: "Current"
- Visit: "inpatient"
- Temporal: "active"
- Condition: "suicidal ideation"
- Procedure: "referral"
- Visit: "inpatient hospitalization"
- Procedure: "hospitalization"
- Mood: "requiring"